Inflammation or infection at the study site

The above is a clinical trial exclusion criterion. Annotated with entity spans:
[Condition: Inflammation] or [Condition: infection] at the [Qualifier: study site]